Clinical trial inclusion criterion:
HBsAg and HBeAg positive for more than 6 months, HBV DNA detectable with ALT level abnormal lasted for three months and at least time190 IU/L or liver puncture biopsy demonstrated apparent inflammation, never treated before enrolled.

Entity relations:
- Has_temporal("HBsAg positive", "for more than 6 months")
- Has_temporal("abnormal", "lasted for three months")
- Has_temporal("190 IU/L", "at least time")
- Has_value("ALT level", "abnormal")
- Has_value("ALT level", "190 IU/L")
- Has_temporal("treated", "before enrolled")
- Has_negation("treated", "never")
- AND("liver puncture biopsy", "inflammation")
- AND("inflammation", "treated")
- AND("HBV DNA detectable", "ALT level")
- OR("HBsAg positive", "HBeAg positive")
- OR("HBsAg positive", "HBV DNA detectable", "liver puncture biopsy")